某日你發現放射部的技師因為弄錯病人而錯照了一張胸部 X 光片。病人並不清楚這件事，也沒有在這過程中受到傷害，此時你應該向上報告這個錯誤嗎？為什麼？
A. 不需通報，因為這是個無傷大雅的錯誤，而且沒有造成任何傷害
B. 不需通報，因為這是無法避免的錯誤，也不能帶來什麼制度性的改變
C. 應該通報，因為弄錯病人是很嚴重的錯誤，技師應該得到應有的懲罰
D. 應該通報，因為表面上單一事件的錯誤，也可能隱藏著系統性的錯誤，不論錯誤的大小輕重，唯有一律通報，才能進行錯誤管理

正確答案：D. 應該通報，因為表面上單一事件的錯誤，也可能隱藏著系統性的錯誤，不論錯誤的大小輕重，唯有一律通報，才能進行錯誤管理